酒癮脫癮引起的癲癇最主要的使用藥物為：
A. Chlordiazepoxide
B. Lorazepam
C. Diazepam
D. Flurazepam

正確答案：C. Diazepam